Clinical trial exclusion criterion:
Having anaphylactic reaction for Rosuvastatin;

Entity relations:
- AND("anaphylactic reaction", "Rosuvastatin")